Clinical trial exclusion criterion:
Chest pain or shortness of breath with activity (such as climbing stairs), peripheral edema, heart palpitations, dry cough, irregular heartbeat, excessive fatigue, unexplained syncope

Entity relations:
- OR("Chest pain", "shortness of breath with activity", "peripheral edema", "heart palpitations", "dry cough", "irregular heartbeat", "excessive fatigue", "syncope")